Clinical trial exclusion criterion:
Implanted medical devices that are incompatible with MRI imaging.

Entity relations:
- multi("incompatible with MRI imaging", "MRI imaging")
- Has_qualifier("medical devices", "incompatible with MRI imaging")